What kind of mutations cause GRK1 associated Oguchi disease?

Biallelic mutations in G-Protein coupled receptor kinase 1 cause Oguchi disease. Oguchi disease is a rare subtype of congenital stationary night blindness.